Patients with history of allergy to PEG.

The above is a clinical trial exclusion criterion. Annotated with entity spans:
Patients with [Temporal: history] of [Condition: allergy] to [Drug: PEG].